Clinical trial exclusion criterion:
History of shoulder tumor

Annotated entities:
- Temporal: "History of"
- Condition: "shoulder tumor"